Entre las estrategias de Regulación Emocional, ¿cuál de las siguientes sería una estrategia de aceptación dentro de las terapias cognitivoconductuales?
1. Distracción.
2. Activación Conductual.
3. Exposición con Prevención de Respuesta.
4. Expresión Emocional Ajustada.
5. Inhibición Emocional.

Respuesta correcta: 4. Expresión Emocional Ajustada.